Clinical trial exclusion criteria:
Pregnancy
Tuberculosis
Hepatitis B or C carrier status
Human immunodeficiency virus-positive status
Retransplantation or multiorgan transplantation
History of rheumatoid arthritis
Use of drugs that might have enhanced or inhibited CYP3A4 or P-gp activity

Annotated entities:
- Condition: "Pregnancy"
- Condition: "Tuberculosis"
- Condition: "Hepatitis B carrier"
- Condition: "Hepatitis C carrier"
- Measurement: "Human immunodeficiency virus"
- Value: "positive"
- Procedure: "Retransplantation"
- Procedure: "transplantation"
- Qualifier: "multiorgan"
- Condition: "rheumatoid arthritis"
- Non-query-able: "Use of drugs that might have enhanced or inhibited CYP3A4 or P-gp activity"